Clinical trial exclusion criterion:
Patients with an expected life expectancy <48 hours

Annotated entities:
- Observation: "expected life expectancy"
- Value: "<48 hours"